Clinical trial exclusion criterion:
Receipt of DTaP, IPV, PCV13, or Hib prior to enrollment. Previous administration of the first dose of HBV is permitted

Annotated entities:
- Drug: "DTaP"
- Drug: "IPV"
- Drug: "PCV13"
- Drug: "Hib"
- Temporal: "prior to enrollment"
- Reference_point: "enrollment"